Which is the chromosome area that the human gene coding for the dopamine transporter (DAT1) is located to?

The gene encoding DAT1 consists of 15 exons spanning 60 kb and is located on chromosome 5p15.3.